根據 American Joint Committee on Cancer（AJCC）出版的 Cancer Staging Manual（2002 年, 第 6 版）， 有關大腸直腸癌之病理分期之敘述，何者為非？
A. 在 stageⅠ時，並沒有淋巴結轉移
B. 在 stageⅡ時，並沒有淋巴結轉移
C. StageⅡ大腸癌經手術治療後，五年存活率大約為 75%
D. 有遠端轉移時（stage Ⅳ）五年存活率大約為 15%

正確答案：D. 有遠端轉移時（stage Ⅳ）五年存活率大約為 15%